El componente de mayor concentración sérica del sistema del complemento es:
1. C1q.
2. C5.
3. C9.
4. C3.

Respuesta correcta: 4. C3.